一位 7 歲小女孩在學校運動會完數週後，即在兩側臉頰出現脫色素斑，其上附有細小的鱗屑。經 KOH 鏡檢並無異常發現，診治後給予弱效的類固醇軟膏，使用一週後即停用，並囑咐加強防曬措施，病灶於兩個月後回復正常膚色，最可能的診斷為何？
A. 脫色素母斑（nevus depigmentosus）
B. 白斑（vitiligo vulgaris）
C. 白色糠疹（pityriasis alba）
D. 變色糠疹（pityriasis versicolor）

正確答案：C. 白色糠疹（pityriasis alba）